Clinical trial inclusion criterion:
diagnosed as type 2 diabetes according to the criteria of the World Health Organization in 1999.

Annotated entities:
- Condition: "type 2 diabetes"
- Qualifier: "criteria of the World Health Organization in 1999"